Medically stable

The above is a clinical trial inclusion criterion. Annotated with entity spans:
[Qualifier: Medically] [Condition: stable]